Clinical trial inclusion criterion:
Brain temperature > 38.5°C for more than 30 minutes

Annotated entities:
- Measurement: "Brain temperature"
- Value: "> 38.5°C"
- Temporal: "for more than 30 minutes"